Clinical trial exclusion criterion:
16. Men who are unwilling to use contraception if their partners are of childbearing potential

Entity relations:
- Has_mood("contraception", "unwilling")
- AND("their partners are of childbearing potential", "contraception")